喉返神經（recurrent laryngeal nerve）的功能與下列何者無關？
A. 傳遞聲襞（vocal folds）以下喉內黏膜之感覺
B. 控制聲門（rima glottidis）之開啟
C. 控制聲門之關閉
D. 控制環甲肌（cricothyroid muscle）之收縮

正確答案：D. 控制環甲肌（cricothyroid muscle）之收縮